Clinical trial exclusion criterion:
Allergy to acetazolamide and other sulfonamides.

Annotated entities:
- Condition: "Allergy"
- Drug: "acetazolamide"
- Drug: "sulfonamides"